Salivary Cortisol is a biomarker for what disease/syndrome/condition?

Salivary Cortisol is a biomarker for stress